Clinical trial inclusion criterion:
ECOG performance status 2.

Entity relations:
- Has_value("ECOG performance status", "2")